Clinical trial inclusion criteria:
Age 18-65
Diagnosis of MDD (Major Depressive Disorder), made or affirmed by a senior psychiatrist in Shalvata
MADRS score > 20
Treated with conventional anti-depressant, administered within a formal psychiatric clinic or by a certified psychiatrist.

Annotated entities:
- Person: "Age"
- Value: "18-65"
- Condition: "MDD"
- Condition: "Major Depressive Disorder"
- Measurement: "MADRS score"
- Value: "> 20"
- Drug: "conventional anti-depressant"
- Procedure: "Treated"